Can speak and write fluent conversational English

The above is a clinical trial inclusion criterion. Annotated with entity spans:
[Non-query-able: Can speak and write fluent conversational English]